環丁烷嘧啶二聚體（cyclobutane pyrimidine dimer）修復時，下列何者為細菌DNA光解酶（photolyase）的輔助因子 （cofactor）？
A. pyridoxal phosphate
B. thiamine pyrophosphate
C. FADH-
D. coenzyme A

正確答案：C. FADH-